關於膀胱儲尿期的神經系統作用，下列敘述何者錯誤？
A. 膀胱漲尿的訊號是經由骨盆神經（pelvic nerve）傳至中樞神經系統
B. 由橋腦儲尿中樞（pontine storage center）發出的訊號是經由骨盆神經（pelvic nerve）傳至尿道外括約肌
C. 交感神經訊號增強，且經由下腹神經（hypogastric nerve）傳至膀胱
D. 膀胱滿漲的訊號可刺激脊髓反射作用稱為防護反射（guarding reflex），可增加禁尿的功能

正確答案：B. 由橋腦儲尿中樞（pontine storage center）發出的訊號是經由骨盆神經（pelvic nerve）傳至尿道外括約肌